History of disabling neurological or psychiatric condition such as epilepsy, multiple sclerosis, cortical stroke, hypoxic-ischemic encephalopathy, encephalitis, or schizophrenia

The above is a clinical trial exclusion criterion. Annotated with entity spans:
[Temporal: History] of [Condition: disabling neurological] or psychiatric condition such as [Condition: epilepsy], [Condition: multiple sclerosis], [Condition: cortical stroke], [Condition: hypoxic-ischemic encephalopathy], [Condition: encephalitis], or [Condition: schizophrenia]